Clinical trial inclusion criterion:
subjects older than 35 years

Entity relations:
- Has_value("years", "older than 35")